Clinical trial exclusion criterion:
Breastfeeding or pregnant (intention to become) females or participation in other clinical trials

Entity relations:
- OR("Breastfeeding", "pregnant")